腎臟血流量在腎臟內分布並不均勻，血流量最多之處位於下列那一個部位？
A. 腎臟皮質
B. 腎臟外側髓質
C. 腎臟內側髓質
D. 腎臟脂肪組織

正確答案：A. 腎臟皮質